Patients with a confirmed diagnosis of:

The above is a clinical trial inclusion criterion. Annotated with entity spans:
P[Parsing_Error: atients with a confirmed diagnosis of:]